新生兒十二指腸閉鎖（duodenal atresia）發生的原因，一般認為是：
A. 血管缺血性壞死
B. 胚胎發育時，空泡（vacuolization）形成失敗
C. 染色體異常
D. 產前創傷

正確答案：B. 胚胎發育時，空泡（vacuolization）形成失敗